Best corrected visual acuity (BCVA) of 20/50 to 20/320 ETDRS equivalent (65 letters to 23 letters) in the study eye, with BCVA decrement primarily attributable to DME.

The above is a clinical trial inclusion criterion. Annotated with entity spans:
[Measurement: Best corrected visual acuity (BCVA)] of [Value: 20/50 to 20/320 ETDRS equivalent] ([Value: 65 letters to 23 letters]) [Qualifier: in the study eye], [Non-representable: with BCVA decrement primarily attributable to DME].